Clinical trial exclusion criterion:
Uncontrolled and ongoing psychiatric diseases;

Annotated entities:
- Condition: "psychiatric diseases"
- Temporal: "ongoing"
- Qualifier: "Uncontrolled"